What is the characteristic domain of histone methyltransferases?

SET (suppressor of variegation, enhancer of zest and trithorax) domain